下列何者不出現在陰莖（penis）主幹的皮膚？
A. 腺（sweat gland）
B. 皮脂腺（sebaceous gland）
C. 平滑肌（smooth muscle）
D. 脂肪細胞（adipocyte）

正確答案：D. 脂肪細胞（adipocyte）